Clinical trial inclusion criterion:
age > 18

Entity relations:
- Has_value("age", "> 18")